一位 52 歲女性糖尿病病人，診斷為 Klebsiella pneumoniae 菌血症合併眼內炎（endophthalmitis）及腦膜炎，選用何者抗生素治療相對最適當？
A. cefazolin（屬第一代頭孢菌素類抗生素 cephalosporins）
B. cefuroxime（屬第二代頭孢菌素類抗生素 cephalosporins）
C. ceftriaxone（屬第三代頭孢菌素類抗生素 cephalosporins）
D. aminoglycosides

正確答案：C. ceftriaxone（屬第三代頭孢菌素類抗生素 cephalosporins）